下列何者是陰莖勃起功能（penile erection）最重要的血管？
A. 陰莖背動脈（dorsal artery of penis）
B. 陰莖深動脈（deep artery of penis）
C. 陰莖淺背靜脈（superficial dorsal vein of penis）
D. 陰莖球動脈（artery of the bulb of penis）

正確答案：B. 陰莖深動脈（deep artery of penis）